Clinical trial exclusion criterion:
Medical, geographic or social conditions impairing the participation in the study or inability to understand and sign the informed consent term.

Annotated entities:
- Post-eligibility: "Medical, geographic or social conditions impairing the participation in the study or inability to understand and sign the informed consent term."